Clinical trial exclusion criterion:
History of or current history of esophageal cancer invading the submucosal layer of the esophagus or more,

Annotated entities:
- Temporal: "History"
- Temporal: "current"
- Condition: "esophageal cancer"
- Qualifier: "invading the submucosal layer of the esophagus"